Clinical trial inclusion criterion:
Patients with PA and stage I (140-159/90-99 mmHg) hypertension

Entity relations:
- Has_qualifier("hypertension", "stage I")